Which disorder is caused by biallelic mutations in G-Protein coupled receptor kinase 1 (GRK1)?

Biallelic mutations in G-Protein coupled receptor kinase 1 (GRK1) cause Oguchi disease, a rare subtype of congenital stationary night blindness (CSNB)